Normal Hormonal investigation: TSH,PRL,FBS

The above is a clinical trial inclusion criterion. Annotated with entity spans:
[Qualifier: Normal] [Measurement: Hormonal investigation]: [Measurement: TSH],[Measurement: PRL],[Measurement: FBS]